1. Personal history of stroke, brain lesions, previous neurosurgery, any personal history of seizure or fainting episode of unknown cause, or head trauma resulting in loss of consciousness, lasting over 30 minutes or with sequela lasting longer than two days.

The above is a clinical trial exclusion criterion. Annotated with entity spans:
[Parsing_Error: 1.] Personal [Temporal: history of] [Condition: stroke], [Condition: brain lesions], [Temporal: previous] [Condition: neurosurgery], any [Temporal: personal history of] [Condition: seizure] or [Condition: fainting episode] of [Qualifier: unknown cause], or [Condition: head trauma resulting in loss of consciousness], [Qualifier: lasting over 30 minutes] or with [Condition: sequela] [Measurement: lasting] [Value: longer than two days].